What is the rate of survival after commotio cordis?

Survival rates for commotio cordis are low, even when resuscitation is performed. Survival rates vary between 10% and 28%.